¿Qué modalidad de la Prueba de Aproximación Conductual (PAC) es la más indicada para valorar la fobia a la oscuridad en la infancia?:
1. Aproximación activa.
2. Exposición pasiva.
3. Aproximación pasiva.
4. Aproximación sucesiva.
5. Exposición activa.

Respuesta correcta: 2. Exposición pasiva.